La planificación farmacéutica, en España, es competencia de:
1. Las autoridades municipales.
2. El Consejo Interterritorial del Sistema Nacional de Salud.
3. Los entes comarcales.
4. La administración estatal.
5. Las Comunidades Autónomas.

Respuesta correcta: 5. Las Comunidades Autónomas.